The thickness of the nerve must be at least 2 mm in short axis and at least 5 mm in the longitudinal axis.

The above is a clinical trial inclusion criterion. Annotated with entity spans:
The [Measurement: thickness of the nerve] must be [Value: at least 2 mm] in short axis and [Value: at least 5 mm] in the longitudinal axis.